Clinical trial exclusion criterion:
4. Preexisting neurological disorders, dementia or previous stroke;

Annotated entities:
- Parsing_Error: "4."
- Condition: "neurological disorders"
- Condition: "dementia"
- Condition: "stroke"
- Temporal: "previous"
- Temporal: "Preexisting"